Clinical trial exclusion criterion:
Participation in another study with investigational drug within the 30 days preceding and during the present study

Annotated entities:
- Non-query-able: "Participation in another study with investigational drug within the 30 days preceding and during the present study"